Clinical trial exclusion criterion:
Severe cardiovascular disorder, renal failure, peritonitis, sepsis

Entity relations:
- Has_qualifier("cardiovascular disorder", "Severe")
- OR("cardiovascular disorder", "peritonitis", "renal failure", "sepsis")